Clinical trial exclusion criterion:
Any debilitating disease prior to the SCI that caused exercise intolerance

Annotated entities:
- Condition: "debilitating disease"
- Temporal: "prior to the SCI"
- Condition: "exercise intolerance"